patients with chronic inflammation diseases

The above is a clinical trial exclusion criterion. Annotated with entity spans:
patients with [Condition: chronic inflammation diseases]